Clinical trial exclusion criterion:
pregnant or lactating (only excluded from imaging study)

Annotated entities:
- Pregnancy_considerations: "pregnant or lactating (only excluded from imaging study)"